RASS score between 0 and -4

The above is a clinical trial inclusion criterion. Annotated with entity spans:
[Measurement: RASS score] [Value: between 0 and -4]